Evidence of neoplastic diseases of the liver

The above is a clinical trial exclusion criterion. Annotated with entity spans:
[Mood: Evidence of] [Condition: neoplastic diseases] of the [Qualifier: liver]